Congenital or acquired coagulopathy as evidence by INR >1.4 or PTT > 1.4 times normal, or Platelets <150,000/mm3 on preoperative laboratory testing

The above is a clinical trial exclusion criterion. Annotated with entity spans:
[Qualifier: Congenital] or [Qualifier: acquired] [Condition: coagulopathy] as evidence by [Measurement: INR] [Value: >1.4] or [Measurement: PTT] [Value: > 1.4 times normal], or [Measurement: Platelets] [Value: <150,000/mm3] on [Procedure: preoperative laboratory testing]